Clinical trial exclusion criterion:
Any other primary DSM-IV diagnosis; DSM-IV criteria for body dysmorphic disorder, bipolar affective disorder, schizophrenia, psychotic disorder, current alcohol/substance abuse.

Annotated entities:
- Qualifier: "DSM-IV"
- Qualifier: "primary"
- Condition: "diagnosis"
- Measurement: "DSM-IV criteria"
- Condition: "body dysmorphic disorder"
- Condition: "bipolar affective disorder"
- Condition: "schizophrenia"
- Condition: "psychotic disorder,"
- Condition: "substance abuse"
- Condition: "alcohol abuse"